Clinical trial exclusion criterion:
Intraretinal edema on OCT;

Annotated entities:
- Condition: "Intraretinal edema"
- Procedure: "OCT"